Una reacción de fosforilación a nivel de sustrato esta catalizada por la:
1. Piruvato deshidrogenasa.
2. Succinil-CoA sintetasa.
3. Citrato sintasa.
4. Hexoquinasa.

Respuesta correcta: 2. Succinil-CoA sintetasa.